Clinical trial exclusion criterion:
History of cochlear implant

Annotated entities:
- Temporal: "History"
- Device: "cochlear implant"